Clinical trial exclusion criterion:
Fetal weight estimation > 4500 g (clinical or ultrasonic)

Entity relations:
- Has_qualifier("Fetal weight estimation", "clinical")
- Has_value("Fetal weight estimation", "> 4500 g")
- OR("clinical", "ultrasonic")